Men of the family of index case

The above is a clinical trial inclusion criterion. Annotated with entity spans:
[Not_a_criteria: Men of the family of index case]